Patient previously enrolled in this study

The above is a clinical trial inclusion criterion. Annotated with entity spans:
[Non-query-able: Patient previously enrolled in this study]